Clinical trial inclusion criterion:
All adult patients 18 years of age or older admitted to the intensive care units of St. Boniface General Hospital with a diagnosis of acute pulmonary blastomycosis requiring mechanical ventilation.

Annotated entities:
- Person: "adult"
- Value: "18 years or older"
- Person: "age"
- Visit: "intensive care units"
- Visit: "St. Boniface General Hospital"
- Procedure: "admitted"
- Condition: "acute pulmonary blastomycosis"
- Procedure: "mechanical ventilation"